Mujer de 72 años que acude al hospital por dolor torácico opresivo de 2 horas de evolución. La presión arterial es de 68/32 mm Hg, la frecuencia cardiaca es de 124 latidos/min, la frecuencia respiratoria es de 32 respiraciones/min, la saturación de oxígeno del 91% con oxígeno al 50%. A la auscultación pulmonar se aprecian crepitantes bilaterales. Se realiza un ECG que muestra lesión subepicárdica en cara anterior, con imagen especular en cara inferior. En la radiografía de tórax se aprecia patrón alveolar bilateral. ¿Cuál es su decisión terapeútica?
1. Iniciar infusión de nitratos i.v.
2. Realizar fibrinolisis con tenecteplase (TNK).
3. Realizar angioplastia coronaria urgente.
4. Administrar furosemida 40 mg i.v.

Respuesta correcta: 3. Realizar angioplastia coronaria urgente.